Clinical trial exclusion criterion:
Current/recent upper respiratory infection (within four weeks prior to the surgery)

Annotated entities:
- Temporal: "Current"
- Temporal: "recent"
- Condition: "upper respiratory infection"
- Temporal: "within four weeks prior to the surgery"
- Reference_point: "the surgery"
- Procedure: "surgery"